Clinical trial inclusion criterion:
Be healthy for their age group with or without medication on the basis of physical examination, medical history, vital signs, and 12-lead electrocardiogram (ECG) performed at Screening or admission. Minor deviations in ECG, which are not considered to be of clinical significance to the investigator, are acceptable

Annotated entities:
- Procedure: "physical examination"
- Temporal: "medical history"
- Measurement: "vital signs"
- Temporal: "performed at Screening or admission"
- Reference_point: "Screening"
- Reference_point: "admission"
- Condition: "deviations in ECG"
- Procedure: "ECG"
- Subjective_judgement: "which are not considered to be of clinical significance to the investigator"
- Grammar_Error: "are acceptable"
- Qualifier: "which are not considered to be of clinical significance to the investigator"